下列何種小腦構造在腦壓升高時容易脫疝（herniation），進而壓迫腦幹？
A. inferior vermis
B. flocculonodular lobe
C. 扁桃體（tonsil）
D. 下小腦腳（inferior cerebellar peduncle）

正確答案：C. 扁桃體（tonsil）